Clinical trial inclusion criterion:
Scheduled for bilateral varus rotational osteotomy (VRO) with or without associated soft tissue and osseous procedures

Entity relations:
- Subsumes("varus rotational osteotomy", "VRO")
- AND("varus rotational osteotomy", "osseous procedures")
- Has_qualifier("varus rotational osteotomy", "bilateral")
- Has_mood("varus rotational osteotomy", "Scheduled for")
- AND("varus rotational osteotomy", "procedures soft tissue")